Clinical trial exclusion criterion:
history of psychiatric illness

Annotated entities:
- Temporal: "history"
- Condition: "psychiatric illness"